Female or male patients.

The above is a clinical trial inclusion criterion. Annotated with entity spans:
[Person: Female] or [Person: male] patients.